硬皮症（systemic sclerosis）根據影響的皮膚範圍，可分為局限型（limited）與瀰漫型（diffuse），局限型病患較常出現之抗核抗體（ANA）是：
A. anti-Jo-l （anti-histidyl t-RNA synthetase）
B. antitopoisomerase I
C. nucleolar ANA
D. anticentromere

正確答案：D. anticentromere